Clinical trial exclusion criteria:
Emergent condition like hematemesis.
Patients with moderate to severe hepatic encephalopathy.
Patients with hepatopulmonary syndrome.
Patients with known or suspected hypersensitivity to the used medication were also excluded from the study.

Annotated entities:
- Condition: "hematemesis"
- Condition: "Emergent condition"
- Qualifier: "severe"
- Qualifier: "moderate"
- Condition: "hepatic encephalopathy"
- Condition: "hepatopulmonary syndrome"
- Condition: "hypersensitivity"
- Mood: "suspected"
- Mood: "known"
- Drug: "used medication"